病人胸痛來到急診，經初步評估後心肌缺氧可能性不高，依照臨床路徑之處理不包括下列那一項？
A. 以臨床症狀監測病人是否再發生心肌缺氧
B. 系列性追蹤十二導程心電圖之變化
C. 在病人無症狀時，於發作後 4 至 6 小時及發作後 12 小時，系列性追蹤心肌酵素之變化
D. 病人來到急診時立即進行催迫性測試（stress test）

正確答案：D. 病人來到急診時立即進行催迫性測試（stress test）